What are the years of the initiation and completion of the Human Genome project?

The Human Genome Project was initiated in 1990 and completed in 2003.